Hypersensitivity to Heparin or its derivatives.

The above is a clinical trial exclusion criterion. Annotated with entity spans:
[Condition: Hypersensitivity] to [Drug: Heparin] or its derivatives.